Clinical trial inclusion criterion:
Any allogeneic stem cell transplant recipient = 14 years of age and = 60 years of age

Annotated entities:
- Procedure: "allogeneic stem cell transplant"
- Value: "= 14 years"
- Person: "age"
- Value: "= 60 years"
- Person: "age"